Males and females with confirmed disease: Fabry (by GLA enzymes and/or DNA testing) naïve and on ERT, Mitochondrial diseases (electron transport chain and/or DNA testing) or connective tissue diseases (clinical criteria and/or DNA testing when available)

The above is a clinical trial inclusion criterion. Annotated with entity spans:
[Person: Males] [Grammar_Error: and] [Person: females] with [Condition: confirmed disease]: [Qualifier: Fabry] (by [Procedure: GLA enzymes] and/or [Procedure: DNA testing]) naïve and on [Procedure: ERT], [Condition: Mitochondrial diseases] ([Procedure: electron transport chain] and/or [Procedure: DNA testing]) or [Condition: connective tissue diseases] ([Observation: clinical criteria] and/or [Procedure: DNA testing] when available)